La toxina colérica:
1. Inhibe la síntesis proteica.
2. Es hemolítica y dermonecrótica.
3. Altera el flujo de electrolitos en el intestino.
4. Está formada por un solo polipéptido que se escinde por efecto de proteasas.
5. Produce intoxicación alimentaria.

Respuesta correcta: 3. Altera el flujo de electrolitos en el intestino.